一位 56 歲女性，具長期高血壓病史但未接受規則性治療，因突發撕裂性劇烈胸痛、呼吸不順、冒冷汗及暈厥（syncope），被家人送至急診，血壓 150/100 mmHg，心跳 110/min，有三度（grade III/VI）收縮期及短暫舒張期心雜音。胸部 X 光顯示左側肋膜積液，縱膈腔稍大。心電圖在導程 II、III、aVF 顯示 ST 波段上升 2 mm 及左心室肥大。下列那一項處置較適當？
A. 應馬上施予胸管引流
B. 應於半小時內開始纖維蛋白溶解療法（fibrinolytic therapy）
C. 應馬上進行動脈血管攝影或胸部電腦斷層檢查
D. 應進行肺部通氣／灌流核醫攝影（ventilation/perfusion lung scan），檢查是否有不相稱缺陷

正確答案：C. 應馬上進行動脈血管攝影或胸部電腦斷層檢查